Clinical trial exclusion criterion:
Has had a solid organ or hematologic transplant

Annotated entities:
- Procedure: "hematologic transplant"
- Procedure: "solid organ transplant"